Clinical trial exclusion criterion:
a known allergy to dexmedetomidine hydrochloride

Entity relations:
- AND("allergy", "dexmedetomidine hydrochloride")